Clinical trial exclusion criterion:
Pediatric facilities

Annotated entities:
- Visit: "Pediatric facilities"